Pilar es una madre de 17 años de un recién nacido de 30 semanas de edad gestacional, que afirma que le hubiera gustado tener una hija y no un niño que le recuerde a la pareja que le ha abandonado. Hasta hace un mes trabajaba de cajera en un supermercado. Indique el diagnóstico de enfermería que presenta:
1. Deterioro parental.
2. Riesgo de alteración de la diada materno/filial.
3. Cansancio del rol de cuidador.
4. Riesgo de proceso de maternidad ineficaz.

Respuesta correcta: 1. Deterioro parental.